Clinical trial exclusion criterion:
hypersensitivity or contraindication to one of the study drugs

Entity relations:
- Has_multiplier("study drugs", "one of")
- AND("hypersensitivity", "study drugs")
- OR("hypersensitivity", "contraindication")